Clinical trial inclusion criterion:
Must agree not to donate blood or other bodily fluid while taking the study drug and for 28 days thereafter

Annotated entities:
- Procedure: "donate blood"
- Negation: "not"
- Mood: "Must agree to"
- Procedure: "donate bodily fluid"
- Temporal: "while taking the study drug"
- Reference_point: "taking the study drug"
- Drug: "study drug"
- Temporal: "for 28 days thereafter"